Clinical trial exclusion criterion:
Patients who have been previously treated with epothilone

Annotated entities:
- Drug: "epothilone"
- Temporal: "previously"